Clinical trial inclusion criterion:
Male or female children between the ages of 10 and 35 years with congenital heart disease that has been palliated with a Fontan circulation.

Annotated entities:
- Person: "Male"
- Person: "female"
- Person: "children"
- Value: "between 10 and 35 years"
- Person: "ages"
- Condition: "congenital heart disease"
- Procedure: "Fontan circulation"